Clinical trial exclusion criterion:
Patients already been registered with other studies; or

Annotated entities:
- Competing_trial: "Patients already been registered with other studies; or"